一位小朋友左眼遭棒球擊中，眼眶部位立即腫大，結膜下出血，左眼球無法向上移動，下列敘述何者錯誤？
A. 小朋友可能有眼眶下緣骨折（infra-orbital rim fracture）
B. 小朋友可能有眼眶底部骨折（orbital floor fracture）
C. 左眼球無法向上移動是因為上直肌卡在眼眶底部骨折
D. 小朋友需要接受眼眶電腦斷層檢查（orbital CT）

正確答案：C. 左眼球無法向上移動是因為上直肌卡在眼眶底部骨折